Locally unresectable tumor

The above is a clinical trial exclusion criterion. Annotated with entity spans:
[Qualifier: Locally unresectable] [Condition: tumor]